下列有關抗生素相關大腸炎（antibiotic-associated colitis）的敘述，何者錯誤？
A. 偽膜性大腸炎（pseudomembranous colitis）最為常見，大部分在遠側大腸、直腸出現
B. 主要因 Clostridium difficile 細菌增生造成
C. 治療可用 metronidazole 或 vancomycin，但 vancomycin 儘可能口服給藥
D. 病人因原來就在接受抗生素治療，因此白血球不會上升，也不會發燒

正確答案：D. 病人因原來就在接受抗生素治療，因此白血球不會上升，也不會發燒